膜蛋白質最常以共價鍵結合下列何種脂質（lipid），而附	在細胞膜外層上？
A. 硬脂酸（stearic acid）
B. 神經鞘氨醇（sphingosine）
C. 糖基化磷脂醯肌醇（glycosyl phosphatidylinositol; GPI）
D. 磷脂醯肌醇（phosphatidylinositol）

正確答案：C. 糖基化磷脂醯肌醇（glycosyl phosphatidylinositol; GPI）